一位 9 歲神經學檢查均正常的男孩，求診時之主訴為偶爾在睡覺時有癲癇大發作（grand mal seizure），白天時亦偶有半邊臉或手腳抽搐之現象。下列敘述何者錯誤？
A. 抗癲癇藥物（antiepileptic drugs）治療效果及預後均佳，青春期後漸痊癒
B. 部分病人與染色體 15q14 有關
C. 半邊大腦切除術（hemispherectomy）是最常用來治療此症的外科治療方法
D. 中央及中顳葉區棘波（central and midtemporal spikes）為其特徵性之腦電圖（EEG）表現

正確答案：C. 半邊大腦切除術（hemispherectomy）是最常用來治療此症的外科治療方法